serious bleeding during the course of the ulcer

The above is a clinical trial exclusion criterion. Annotated with entity spans:
[Qualifier: serious] [Condition: bleeding] [Temporal: during the course of the ulcer]